Patients with chronic infection with Hepatitis B virus (HBV) and / or active infection with Hepatitis C virus (positive PCR result) at the time of transplant.

The above is a clinical trial exclusion criterion. Annotated with entity spans:
Patients with [Qualifier: chronic] infection with [Condition: Hepatitis B virus (HBV)] and / or [Qualifier: active] infection with [Condition: Hepatitis C virus] ([Value: positive] [Procedure: PCR result]) [Temporal: at the time of transplant].